Las escalas McCarthy para niños (MSCA):
1. No incluyen una escala general cognitiva.
2. Se aplican a partir de los 8 años y medio.
3. Incluyen una escala de psicomotricidad.
4. Se aplican de forma colectiva, por lo que son de utilidad en el ámbito escolar.

Respuesta correcta: 3. Incluyen una escala de psicomotricidad.